What 3 organs are the sphincter of Oddi associated with?

The sphincter of Oddi is a dynamic structure located strategically at the confluence of the bile duct, the pancreatic duct and the duodenum.